Clinical trial inclusion criterion:
Age = 18 years old.

Annotated entities:
- Person: "Age"
- Value: "= 18 years old"